previous enrolment in this study

The above is a clinical trial inclusion criterion. Annotated with entity spans:
[Non-query-able: previous enrolment in this study]